Not seeking pregnancy during the study period

The above is a clinical trial inclusion criterion. Annotated with entity spans:
[Pregnancy_considerations: Not seeking pregnancy during the study period]